計算年齡與體重兩個變項的皮爾森氏相關係數 r（Pearson's correlation coefficient），下列敘述何者正確？
A. r＝0.25，表示每增加年齡 1 歲，體重就增加 0.25 倍
B. r 值為 0，表示兩個變項之間沒有線性相關
C. 體重單位用公斤或英鎊，r 值不同
D. r＝-0.8，表示年齡愈大體重就愈重

正確答案：B. r 值為 0，表示兩個變項之間沒有線性相關